Patients with Ph (BCR/ABL) positive de novo < 55 years old (it is advisable to include patients over 55 years LAL07OPH protocol).

The above is a clinical trial inclusion criterion. Annotated with entity spans:
Patients with [Measurement: Ph (BCR/ABL)] [Value: positive] [Qualifier: de novo] [Value: < 55 years] [Person: old] [Non-representable: (it is advisable to include patients over 55 years LAL07OPH protocol)].